Clinical trial exclusion criterion:
allergy to lidocaine

Entity relations:
- AND("allergy", "lidocaine")